Amnestic and other cognitive disorder;

The above is a clinical trial exclusion criterion. Annotated with entity spans:
[Condition: Amnestic] and other [Condition: cognitive disorder];